Current autoimmune disease;

The above is a clinical trial exclusion criterion. Annotated with entity spans:
[Temporal: Current] [Condition: autoimmune disease];